Clinical trial exclusion criterion:
Inability to participate or attend biweekly 30 minute session over 14 weeks

Annotated entities:
- Non-query-able: "Inability to participate or attend biweekly 30 minute session over 14 weeks"